Musculoskeletal etiology of low back. Patients with non-musculoskeletal etiologies such as urinary tract infection, ovarian cysts, or influenza like illness will be excluded. The primary clinical diagnosis, at the conclusion of the ED visit, must be a diagnosis consistent with non-traumatic, non-radicular, musculoskeletal LBP.

The above is a clinical trial inclusion criterion. Annotated with entity spans:
[Qualifier: Musculoskeletal] [Condition: etiology] of [Qualifier: low back]. Patients with [Negation: non]-[Qualifier: musculoskeletal] [Condition: etiologies] such as [Condition: urinary tract infection], [Condition: ovarian cysts], or [Condition: influenza like illness] will be [Negation: excluded]. The primary clinical diagnosis, at the conclusion of the ED visit, must be a diagnosis consistent with [Qualifier: non-traumatic], [Qualifier: non-radicular], [Qualifier: musculoskeletal] [Condition: LBP].